29 歲女性被送至急診是因為氣促（shortness of breath）及意識不清（conscious disturbance）。實驗數據如下：pH 7.32, HCO3- 6 mEq/L, PaCO2 12 mmHg, Na+ 142 mEq/L, Cl- 110 mEq/L。此病人之酸鹼狀況（acid-base status）之最適切描述為何？
A. 代謝性酸血症與適當之呼吸代償（metabolic acidosis with appropriate respiratory compensation）
B. 代謝性酸血症合併呼吸酸血症（combined metabolic acidosis and respiratory acidosis）
C. 代謝性酸血症合併呼吸鹼血症（combined metabolic acidosis and respiratory alkalosis）
D. 只有代謝性酸血症（metabolic acidosis only）

正確答案：C. 代謝性酸血症合併呼吸鹼血症（combined metabolic acidosis and respiratory alkalosis）